men and women 30-55 years with BMI 30-40 and waist 95 cm or more

The above is a clinical trial inclusion criterion. Annotated with entity spans:
[Person: men] and [Person: women] [Value: 30-55 years] with [Measurement: BMI] [Value: 30-40] and [Measurement: waist] [Value: 95 cm or more]